Functionally impairing back pain: A baseline score of > 5 on the Roland-Morris Disability Questionnaire

The above is a clinical trial inclusion criterion. Annotated with entity spans:
[Qualifier: Functionally impairing] [Condition: back pain]: A [Temporal: baseline] [Value: score of > 5] on the [Measurement: Roland-Morris Disability Questionnaire]